Clinical trial inclusion criterion:
Diagnosis of emphysema confirmed by CT scan. If a report of past CT scan is not available at site documenting then a CT scan is to be performed at screening

Entity relations:
- AND("emphysema", "CT scan")
- Has_temporal("CT scan", "past")
- AND("report of past CT scan", "CT scan")
- Has_negation("CT scan", "not available")
- AND("report of past CT scan", "CT scan")
- Has_temporal("CT scan", "at screening")
- Subsumes("CT scan", "report of past CT scan")
- Has_index("at screening", "screening")